Babinski sign 出現於成人之可能原因為何？
A. lateral corticospinal tract 損傷
B. basal ganglion 損傷
C. lower motor neuron 損傷
D. vestibulospinal tract 損傷

正確答案：A. lateral corticospinal tract 損傷